Clinical trial inclusion criterion:
No history of GI pathology

Entity relations:
- Has_temporal("GI pathology", "history")
- Has_negation("GI pathology", "No")